Clinical trial inclusion criterion:
• Family history of SpA (presence of ankylosing spondylitis, psoriasis, acute uveitis, reactive arthritis, or IBD)

Annotated entities:
- Observation: "Family history"
- Condition: "SpA"
- Condition: "ankylosing spondylitis"
- Condition: "psoriasis"
- Condition: "acute uveitis"
- Condition: "reactive arthritis"
- Condition: "IBD"